La filtración capilar es mayor en el capilar:
1. Sinusoide.
2. Fenestrado.
3. Continuo.
4. De la barrera hematoencefálica.

Respuesta correcta: 1. Sinusoide.